Uno de los siguientes compuestos produce daño hepático como efecto tóxico principal:
1. Dietilenglicol.
2. Metanol.
3. Acetona.
4. Benceno.
5. Tetracloruro de carbono.

Respuesta correcta: 5. Tetracloruro de carbono.